林先生，78 歲，最近 10 年內因慢性阻塞性肺病之急性發作，多次住院。最近三天因呼吸逐漸窘迫，至急診就醫。理學檢查呈現輕度嗜睡狀態，肺部聽診有瀰漫性喘鳴、痰量不多，動脈血氣體分析 pH = 7.35、PCO2 = 72 mmHg、PO2 = 47 mmHg，經與家屬溝通後，家屬主張積極治療，則下列何者為最優先之有效處置方式？
A. 由鼻管給予氧氣，流速 1-2 公升/分
B. 使用 Venturi mask，FIO2 = 28%
C. 使用非侵襲性呼吸器治療（Bi-PAP）
D. 立刻氣切插管，使用呼吸器治療

正確答案：C. 使用非侵襲性呼吸器治療（Bi-PAP）